Clinical trial inclusion criterion:
Patient who undergoing gynecologic laparoscopic surgery

Annotated entities:
- Procedure: "gynecologic laparoscopic surgery"